HBV infected or HCV infected (these increase the risk of TB-drug induced hepatotoxicity)

The above is a clinical trial exclusion criterion. Annotated with entity spans:
[Condition: HBV infected] or [Condition: HCV infected] [Non-representable: (these increase the risk of TB-drug induced hepatotoxicity)]